Children with systemic illness that contraindicated vital pulp treatment such a sickle cell disease

The above is a clinical trial exclusion criterion. Annotated with entity spans:
Children with [Condition: systemic illness] that [Condition: contraindicated] [Procedure: vital pulp treatment] such a [Condition: sickle cell disease]